history of severe chronic diseases

The above is a clinical trial exclusion criterion. Annotated with entity spans:
[Temporal: history] of [Qualifier: severe] [Condition: chronic diseases]